陳太太懷孕 31 週突然發生無痛性的陰道出血，最可能是那種情況？
A. 先兆性流產
B. 妊娠毒血症
C. 前置胎盤
D. 胎盤早期剝離

正確答案：C. 前置胎盤